Severe, symptomatic aortic stenosis,

The above is a clinical trial inclusion criterion. Annotated with entity spans:
[Qualifier: Severe], [Qualifier: symptomatic] [Condition: aortic stenosis],